急性腎衰竭是手術常見的併發症之一。導致急性腎衰竭的原因常常是腎前因素，也就是血量不足以致腎灌流不足。診斷腎前急性腎衰竭可以藉助檢測尿液鈉離子濃度得知。下列何項敘述是符合腎前因素造成腎衰竭的診斷？
A. 每公升尿液鈉離子含量小於 20 meq
B. 每公升尿液鈉離子含量介於 20~30 meq
C. 每公升尿液鈉離子含量介於 30~40 meq
D. 每公升尿液鈉離子含量大於 40 meq

正確答案：A. 每公升尿液鈉離子含量小於 20 meq